histologically diagnosed primary classical osteosarcoma in extremities

The above is a clinical trial inclusion criterion. Annotated with entity spans:
[Procedure: histologically] diagnosed [Qualifier: primary] [Condition: classical osteosarcoma] [Qualifier: in extremities]